Clinical trial exclusion criterion:
Blood Pressure =140/90 mmHg

Annotated entities:
- Measurement: "Blood Pressure"
- Value: "=140/90 mmHg"